Clinical trial exclusion criterion:
Severe hepatic or renal failure

Annotated entities:
- Qualifier: "Severe"
- Condition: "renal failure"
- Condition: "hepatic failure"